Clinical trial inclusion criterion:
The diagnosis of chronic bronchitis

Annotated entities:
- Condition: "chronic bronchitis"